Clinical trial exclusion criterion:
Extra-pulmonary infection requiring antibiotic therapy (e.g. meningitis)

Entity relations:
- Has_qualifier("infection", "Extra-pulmonary")
- Subsumes("infection", "meningitis")
- AND("infection", "antibiotic therapy")